Clinical trial exclusion criterion:
Active uncontrolled bleeding

Annotated entities:
- Condition: "bleeding"
- Qualifier: "Active"
- Qualifier: "uncontrolled"